Clinical trial exclusion criterion:
Any other indication for dual antiplatelet therapy, i.e. recent stent implantation

Entity relations:
- Has_temporal("stent implantation", "recent")
- AND("indication", "dual antiplatelet therapy")